Clinical trial inclusion criteria:
Mild-to-moderate RDS;
Postnatal age 2 to 48 hours;
Gestational age 27 0/7 to 36 6/7 weeks;
Treated with nasal CPAP modalities = 5 cm H2O and FiO2 between 0.30 and 0.60 for at least 2 hours to maintain SpO2 90-95%;
Informed consent

Annotated entities:
- Value: "Mild-to-moderate"
- Measurement: "RDS"
- Measurement: "Postnatal age"
- Value: "2 to 48 hours"
- Measurement: "Gestational age"
- Value: "27 0/7 to 36 6/7 weeks"
- Measurement: "nasal CPAP"
- Value: "= 5 cm H2O"
- Measurement: "FiO2"
- Value: "between 0.30 and 0.60"
- Temporal: "for at least 2 hours"
- Measurement: "SpO2"
- Value: "90-95%"
- Informed_consent: "Informed consent"